allergy to lidocaine

The above is a clinical trial exclusion criterion. Annotated with entity spans:
[Condition: allergy] to [Drug: lidocaine]